Clinical trial inclusion criterion:
Be between age 18 and 55 years

Annotated entities:
- Person: "age"
- Value: "between 18 and 55 years"